Mean pulmonary artery pressures =40mmHG and PVR >4 woods units as assessed by right heart catheterization.

The above is a clinical trial exclusion criterion. Annotated with entity spans:
[Measurement: Mean pulmonary artery pressures] [Value: =40mmHG] and [Measurement: PVR] [Value: >4 woods units] as assessed by [Condition: right heart catheterization].